Clinical trial exclusion criterion:
Radiation exposures exceeding annual Rad Worker limits.

Annotated entities:
- Measurement: "Radiation exposures"
- Value: "exceeding annual Rad Worker limits"